Clinical trial inclusion criterion:
Elevated blood-cholesterol

Entity relations:
- Has_value("blood-cholesterol", "Elevated")